Inadequate bone marrow reserve

The above is a clinical trial exclusion criterion. Annotated with entity spans:
[Condition: Inadequate bone marrow reserve]